闌尾炎為常見之急性腹症，下列敘述何者不合宜？
A. 急性闌尾炎為最常見的腹部急症，常好發於老年人及兒童
B. 麥氏點（McBurney's point) 為右下腹髂前上棘（anterior superior iliac spine）與肚臍連線外三分之一處
C. 對於沒有發生併發症的急性闌尾炎可以考慮非手術治療，但目前仍以闌尾切除為標準治療
D. 約有1%的病患為闌尾惡性腫瘤，所以仍須作最後的病理檢查

正確答案：A. 急性闌尾炎為最常見的腹部急症，常好發於老年人及兒童